Person has a history of chronic skin breakdown on the residual limb.

The above is a clinical trial exclusion criterion. Annotated with entity spans:
Person has a history of [Qualifier: chronic] [Condition: skin breakdown] on the [Qualifier: residual limb].